Clinical trial exclusion criterion:
Previous myocardial infarction

Annotated entities:
- Condition: "Previous myocardial infarction"